Patients with clinically significant ventricular tachycardia, atrial fibrillation, atrial flutter or other clinically significant arrhythmia at the discretion of the investigator

The above is a clinical trial exclusion criterion. Annotated with entity spans:
Patients with [Qualifier: clinically significant] [Condition: ventricular tachycardia], [Condition: atrial fibrillation], [Condition: atrial flutter] or other [Qualifier: clinically significant] [Condition: arrhythmia] at the discretion of the investigator